病人於睡眠中因頭痛而痛醒，這位病人頭痛的病因中，以下何者是最不可能的答案？
A. 腦瘤引起腦壓上昇
B. 緊張性頭痛（Tension headache）
C. 偏頭痛（migraine）
D. 三叉神經痛

正確答案：B. 緊張性頭痛（Tension headache）